Previously treated with mirabegron within 60 days prior to the baseline visit (Visit 2), or previously having failed treatment with mirabegron regardless of duration and timing of treatment.

The above is a clinical trial exclusion criterion. Annotated with entity spans:
Previously treated with [Drug: mirabegron] [Temporal: within 60 days prior to the baseline visit] (Visit 2), or previously having failed treatment with mirabegron regardless of duration and timing of treatment.